Clinical trial exclusion criteria:
Ulcers due to non-diabetic etiology.
Uncontrolled diabetes defined as HbA1c above 70 mmol/mol and insufficient nutritional status.
Ulcers older than 1 year.
Any of gangrene, osteomyelitis, cellulitis, or Charcot osteoarthropathy.

Annotated entities:
- Condition: "Ulcers"
- Qualifier: "non-diabetic"
- Condition: "Uncontrolled diabetes"
- Measurement: "HbA1c"
- Value: "above 70 mmol/mol"
- Condition: "insufficient nutritional status"
- Condition: "Ulcers"
- Temporal: "older than 1 year"
- Condition: "gangrene"
- Multiplier: "Any of"
- Condition: "osteomyelitis"
- Condition: "cellulitis"
- Condition: "Charcot osteoarthropathy"